某腦中風患者語言理解能力與說話流利度皆有缺損，但是對於醫護人員給予的口頭指令，皆可以完整重複說出。該病患最可能罹患那一種類型的失語症？
A. Wernicke 氏失語症
B. 傳導性失語症（conduction aphasia）
C. Broca 氏失語症
D. 皮質間性失語症（transcortical aphasia）

正確答案：D. 皮質間性失語症（transcortical aphasia）